Clinical trial exclusion criterion:
being <50% breastfed at the time of inclusion

Entity relations:
- Has_multiplier("breastfed", "<50%")
- Subsumes("breastfed", "at the time of inclusion")